Clinical trial exclusion criterion:
left atrial thrombus on transesophageal echocardiography study performed after successful left atrial appendage closure but before enrollment

Annotated entities:
- Condition: "left atrial thrombus"
- Procedure: "transesophageal echocardiography"
- Procedure: "left atrial appendage closure"
- Temporal: "after successful left atrial appendage closure"
- Reference_point: "successful left atrial appendage closure"
- Qualifier: "successful"
- Temporal: "before enrollment"
- Reference_point: "enrollment"